current or past diagnosis of bipolar and other related disorders, schizophrenia spectrum, or other psychotic disorders

The above is a clinical trial exclusion criterion. Annotated with entity spans:
current or past diagnosis of [Condition: bipolar] and [Qualifier: other] [Condition: related disorders], [Condition: schizophrenia spectrum], or other [Condition: psychotic disorders]